Inability to walk (bed-bound or wheelchair dependence)

The above is a clinical trial exclusion criterion. Annotated with entity spans:
[Condition: Inability to walk] ([Condition: bed-bound] or [Condition: wheelchair dependence])